有位橄欖球選手在比賽時，因膝關節受傷被送到急診室，檢查時發現膝關節腫脹變形，當回顧比賽錄影帶 時，發現受傷機轉是膝部發生過度伸展（hyperextension）合併內翻機轉（varus mechanism），下列處置
 何者錯誤？
A. 馬上送到手術房進行手術，因為有可能膝關節脫臼（knee dislocation）
B. 馬上施行普通X光檢查（plain X-ray），因為要評估相對位置
C. 馬上評估血管，因為有高比例血管受傷（vascular injury）
D. 持續評估是否有肌腔室症候群（compartment syndrome），避免嚴重併發症

正確答案：A. 馬上送到手術房進行手術，因為有可能膝關節脫臼（knee dislocation）